Patients with liver disease (documented liver function test abnormality)

The above is a clinical trial exclusion criterion. Annotated with entity spans:
Patients with [Condition: liver disease] (documented [Measurement: liver function test] [Value: abnormality])